一位40歲女性因為升結腸癌接受右半結腸根除性手術，術後48小時高燒不退。請依此回答下列3題：下列何者是最可能的原因？
A. 肺炎（pneumonia）
B. 吻合處滲漏（anastomotic site leakage）
C. 肺部膨脹不全（lung atelectasis）
D. 傷口感染（surgical wound infection）

正確答案：C. 肺部膨脹不全（lung atelectasis）